Male sex

The above is a clinical trial inclusion criterion. Annotated with entity spans:
[Person: Male] sex